一位36歲女性，過去無特殊不適，亦未服用任何藥物，最近兩天出現左下肢腫脹、疼痛，經血管超音波檢查發現是深層靜脈栓塞。其周邊血檢查顯示血紅素12.1 gm/dL，白血球 1，partial thromboplastin time 55"（control：28"），thrombin time 14.7"（control：5.1"），以下何者是最優先要做的檢查？
A. lupus anticoagulant
B. factor VIII
C. protein S
D. protein C

正確答案：A. lupus anticoagulant